Clinical trial exclusion criterion:
Subjects unlikely to cooperate in the study or with inability or unwillingness to give informed consent.

Annotated entities:
- Post-eligibility: "ubjects unlikely to cooperate in the study or with inability or unwillingness to give informed consent"